Planning neuraxial anesthesia

The above is a clinical trial inclusion criterion. Annotated with entity spans:
[Mood: Planning] [Procedure: neuraxial anesthesia]